Other significant co-morbid disease that would prevent participation in exercise

The above is a clinical trial exclusion criterion. Annotated with entity spans:
Other [Qualifier: significant] [Condition: co-morbid disease] [Qualifier: that would prevent participation in exercise]